Clinical trial exclusion criterion:
Untreated, severe, left sided valvular heart disease including mitral regurgitation or stenosis, and aortic regurgitation or stenosis.

Entity relations:
- Has_qualifier("valvular heart disease", "left sided")
- Has_qualifier("valvular heart disease", "severe")
- Has_qualifier("valvular heart disease", "Untreated")
- Subsumes("valvular heart disease", "mitral regurgitation")
- OR("mitral regurgitation", "aortic stenosis", "aortic regurgitation", "mitral stenosis")